吸蟲（trematodes）生活史大多需經兩種中間宿主，下列何者為共同必需的中間宿主？
A. 水生植物
B. 淡水螺
C. 淡水魚
D. 節肢動物

正確答案：B. 淡水螺